Clinical trial exclusion criterion:
Metastatic disease to the breast.

Annotated entities:
- Condition: "Metastatic disease"
- Qualifier: "to the breast"